Clinical trial exclusion criterion:
Active opioid dependence

Entity relations:
- Has_qualifier("opioid dependence", "Active")